當懷疑病人為 Acute colonic pseudo-obstruction 時，第一優先考慮要做的檢查應該是下列那一項？
A. Colonosocpy
B. Water-soluble contrast enema
C. Barium enema
D. Double contrast colon series

正確答案：B. Water-soluble contrast enema